Written informed consent signed by the participant

The above is a clinical trial inclusion criterion. Annotated with entity spans:
[Informed_consent: Written informed consent signed by the participant]